Indications for concomitant treatment with antiplatelet agents

The above is a clinical trial exclusion criterion. Annotated with entity spans:
[Mood: Indications] for [Temporal: concomitant] treatment with [Drug: antiplatelet agents]